Hombre de 51 años que es ingresado desde Urgencias por anemia macrocítica (Hb 6,3 g/dL, VCM 120 fL). En los estudios realizados se descarta un origen carencial. Los reticulocitos son de 24000/microL. El estudio de médula ósea es compatible con un síndrome mielodisplásico (SMD). La citogenética muestra una delección en 5q. ¿Cuál es la afirmación correcta en relación a este paciente?
1. Esta delección (5q-) es una alteración de buen pronóstico y tiene un tratamiento específico (la lenalidomida).
2. Lo recomendable en este paciente sería realizar tipajes HLA para organizar un trasplante alogénico.
3. Se trata de un paciente con un Índice Internacional de Pronóstico (IPSS) alto.
4. El tratamiento en este caso serían las transfusiones únicamente.

Respuesta correcta: 1. Esta delección (5q-) es una alteración de buen pronóstico y tiene un tratamiento específico (la lenalidomida).